How is active neurotoxin of Clostridium botulinum detected?

Active neurotoxin of Clostridium botulinum can be detected by:
mouse lethality assay
by mass spectrometry
bioassay
differentiated cell models
peptide cleavage assay
FDC (functional dual coating) microtitre plate immuno-biochemical assay
endopeptidase activity monitored via UV-Visible spectroscopy